severe cardiovascular disease, liver and kidney disease, and complications of diabetes

The above is a clinical trial exclusion criterion. Annotated with entity spans:
[Qualifier: severe] [Condition: cardiovascular disease], [Condition: liver] and [Condition: kidney disease], and [Condition: complications] of [Condition: diabetes]